下列有關足跟骨的描述，何者錯誤？
A. 跟骨骨折約有 10%病患合併腰椎骨折
B. 跟骨骨折約有 10%病患產生足跟部腔室症候群，結果造成 fixed clawing of the toes
C. 依 Essex-Lopresti classification，跟骨骨折可分為 Tongue type 及 Joint depression type
D. 正常跟骨 Böhler angle 小於 20 度

正確答案：D. 正常跟骨 Böhler angle 小於 20 度